• Elevated CRP

The above is a clinical trial inclusion criterion. Annotated with entity spans:
• [Value: Elevated] [Measurement: CRP]